下列何者為足月生產兒童最常見的先天性心臟病？
A. 心室中隔缺損（ventricular septal defect）
B. 第二型心房中隔缺損（atrial septal defect secundum）
C. 法洛氏四重症（tetralogy of Fallot）
D. 開放性動脈導管（patant ductus arteriosus）

正確答案：A. 心室中隔缺損（ventricular septal defect）